Clinical trial exclusion criterion:
Subjects with weight that varies greater than 20% over the past 3 months.

Entity relations:
- Has_temporal("varies greater than 20%", "over the past 3 months")
- Has_qualifier("weight", "varies greater than 20%")